Clinical trial exclusion criterion:
Emergent re intervention

Entity relations:
- Has_qualifier("re intervention", "Emergent")